metabolic disorder

The above is a clinical trial exclusion criterion. Annotated with entity spans:
[Condition: metabolic disorder]